一位醫院高階主管之親戚罹患乳癌，經打過招呼，外科主任親自開刀，並在手術時使用較好的器具及醫材。術後查房時也常優先且特別用心處理此病人的問題。這位主任醫師如此做是違背下列那一倫理原則？
A. 公平正義原則（Justice）
B. 行善原則（Beneficence）
C. 不傷害原則（Non-maleficence）
D. 病人自主原則（Autonomy）

正確答案：A. 公平正義原則（Justice）